Patients with foot fracture scheduled for surgical repair in spinal anesthesia

The above is a clinical trial inclusion criterion. Annotated with entity spans:
Patients with [Condition: foot fracture] [Mood: scheduled for] [Procedure: surgical repair] in [Procedure: spinal anesthesia]